截肢手術後，下列何者不屬於殘肢端（stump）疼痛的常見原因？
A. 傷口感染
B. 殘肢端骨膜增生或骨刺形成
C. 殘肢端神經末端受刺激或神經瘤形成
D. 殘肢端血管栓塞

正確答案：D. 殘肢端血管栓塞